Clinical trial inclusion criterion:
14. Females of childbearing potential must have a negative pregnancy test (urine β-hCG).

Entity relations:
- Subsumes("pregnancy test", "urine β-hCG")
- Has_value("pregnancy test", "negative")
- AND("Females", "pregnancy test")
- AND("childbearing potential", "pregnancy test")